Clinical trial exclusion criterion:
Untreated thyroid disease

Annotated entities:
- Condition: "thyroid disease"
- Qualifier: "Untreated"